Clinical trial inclusion criterion:
2. Non-smoker

Annotated entities:
- Condition: "Non-smoker"